Age between 18 and 49 years old;

The above is a clinical trial inclusion criterion. Annotated with entity spans:
[Person: Age] [Value: between 18 and 49 years old];